15. Lack of availability for immunological and clinical follow-up assessment.

The above is a clinical trial exclusion criterion. Annotated with entity spans:
[Parsing_Error: 15.] [Negation: Lack of] [Mood: availability for] [Procedure: immunological] and [Procedure: clinical follow-up assessment].